腎臟中腎素（renin）是由何種細胞分泌的？
A. 近腎絲球細胞（jextaglomerular cells）
B. 緻密斑（macula densa）
C. 腎絲球間質細胞（mesangial cells）
D. 入球小動脈內皮細胞（endothelial cells of afferent arteriole）

正確答案：A. 近腎絲球細胞（jextaglomerular cells）